birth asphyxia

The above is a clinical trial exclusion criterion. Annotated with entity spans:
[Condition: birth asphyxia]